下列何者負責DNA結合蛋白形成二聚體（protein dimers）的主要基序（motif）？
A. β-barrel
B. homeodomain
C. leucine zipper
D. zinc finger

正確答案：C. leucine zipper